How are triple negative gliomas characterized?

of these markers - 1p/19q deletions , mgmt methylation status , and mutations in the idh1 gene - are so potent that a new brain tumor subtype , the "triple negative" glioma (1p/19q intact , mgmt unmethylated , idh1 non-mutated) has entered common parlance .